下列酵素參與由無機物的氮（Inorganic nitrogen）轉變為有機分子（Organic molecule），何者為非？
A. Arginase
B. Glutamate dehydrogenase
C. Glutamine synthetase
D. Nitrogenase

正確答案：A. Arginase